Clinical trial inclusion criterion:
social security affiliation

Annotated entities:
- Observation: "social security affiliation"